Clinical trial exclusion criteria:
Exclusion criteria are pregnancy, patients with contraindications to regional anesthesia, allergy to LAs, patients taking opioids regularly due to chronic pain, use of anticoagulation drugs other than acetylsalicylic acid or dipyridamole, atrioventricular block, diabetes.

Annotated entities:
- Condition: "pregnancy"
- Condition: "contraindications"
- Procedure: "regional anesthesia"
- Condition: "allergy"
- Drug: "LAs"
- Drug: "opioids"
- Multiplier: "regularly"
- Condition: "chronic pain"
- Drug: "anticoagulation drugs"
- Drug: "acetylsalicylic acid"
- Drug: "dipyridamole"
- Condition: "atrioventricular block"
- Condition: "diabetes"
- Negation: "other than"